Clinical trial inclusion criterion:
Planned operation of laparoscopic Roux-en Y gastric bypass (LRYGB) or laparoscopic sleeve gastrectomy (LSG) as primary bariatric procedure

Annotated entities:
- Procedure: "laparoscopic Roux-en Y gastric bypass (LRYGB)"
- Procedure: "laparoscopic sleeve gastrectomy (LSG)"
- Qualifier: "primary"